Clinical trial exclusion criterion:
Thyroid disease with thyroid function poorly controlled on prescribed medications. Patients with abnormal thyroid stimulating hormone or T4 concentrations, with elevation of antibodies to thyroid peroxidase and any clinical manifestations of thyroid disease are excluded.

Annotated entities:
- Condition: "Thyroid disease"
- Measurement: "thyroid function"
- Value: "poorly controlled"
- Qualifier: "on prescribed medications"
- Value: "abnormal"
- Measurement: "thyroid stimulating hormone"
- Measurement: "T4 concentrations"
- Measurement: "antibodies to thyroid peroxidase"
- Value: "elevation"
- Condition: "clinical manifestations of thyroid disease"